Clinical trial inclusion criterion:
Age from 18 to 74 years

Annotated entities:
- Person: "Age"
- Value: "from 18 to 74 years"